囟門（fontanelle）過大之相關疾病，下列何者錯誤？
A. 甲狀腺機能亢進
B. 骨骼異常
C. 染色體異常
D. 水腦

正確答案：A. 甲狀腺機能亢進